Known acute pericarditis and/or subacute bacterial endocarditis

The above is a clinical trial exclusion criterion. Annotated with entity spans:
Known [Condition: acute pericarditis] and/or [Condition: subacute bacterial endocarditis]